Abnormalities of laboratory values: alanine-aminotransferase (ALAT), aspartate-aminotransferase (ASAT), gamma-glutamyl transferase (gammaGT), alkalic phosphatase (AP), bilirubin, amylase, lipase, cystatin C, creatinine, white blood cell count, haemoglobin, platelet count, prothrombin time, aPTT, fibrinogen, thrombin time, factors II,V,VII and X

The above is a clinical trial exclusion criterion. Annotated with entity spans:
[Value: Abnormalities] of laboratory values: [Measurement: alanine-aminotransferase] ([Measurement: ALAT]), [Measurement: aspartate-aminotransferase] ([Measurement: ASAT]), [Measurement: gamma-glutamyl transferase] ([Measurement: gammaGT]), [Measurement: alkalic phosphatase] ([Measurement: AP]), [Measurement: bilirubin], [Measurement: amylase], [Measurement: lipase], [Measurement: cystatin C], [Measurement: creatinine], [Measurement: white blood cell count], [Measurement: haemoglobin], [Measurement: platelet count], [Measurement: prothrombin time,] [Measurement: aPTT], [Measurement: fibrinogen], [Measurement: thrombin time], [Measurement: factors II],V,VII and X